一位 8 個月大的嬰兒因發燒 2 天求診，退燒時活力正常，理學檢查發現前囟門鼓起，血中白血球數目為4,300/mm3，脊髓液檢查正常，頭部超音波無異常影像。其腦部最可能的病情為：
A. 細菌性腦膜炎（bacterial meningitis）
B. 假性腦腫瘤（pseudotumor cerebri）
C. 腦腫瘤（brain tumor）
D. 水腦（hydrocephalus）

正確答案：B. 假性腦腫瘤（pseudotumor cerebri）